No history of using 5-ASA, biological or immunomodulatory therapy

The above is a clinical trial exclusion criterion. Annotated with entity spans:
[Negation: No] [Temporal: history] of using [Drug: 5-ASA], biological or [Procedure: immunomodulatory therapy]